63 歲女性病患，主訴前一晚開始右眼疼痛、流淚、視力模糊以及頭痛。就診時右眼檢查發現有眼球輪部放射狀充血（ciliary congestion），角膜混濁，瞳孔呈半擴張狀態，虹膜呈周邊隆起（iris bombe）狀態，前房很淺，眼壓測量右眼 54 mmHg，請問此病患最可能的診斷為下列何者？
A. 隅角開放性青光眼（open angle glaucoma）
B. 急性隅角閉鎖性青光眼（acute angle closure glaucoma）
C. 中心視網膜靜脈阻塞（central retinal vein occlusion）
D. 裂孔性視網膜剝離（rhegmatogenous retinal detachment）

正確答案：B. 急性隅角閉鎖性青光眼（acute angle closure glaucoma）